高泌乳激素血症（hyperprolactinemia）出現的症狀，下列何者相關性最小？
A. 乳汁分泌
B. 月經異常
C. 噁心、嘔吐
D. 頭痛與視覺障礙

正確答案：C. 噁心、嘔吐